Clinical trial exclusion criterion:
Hypersensitivity to the active substance, or to any of the excipients of Lemtrada®

Annotated entities:
- Condition: "Hypersensitivity"
- Drug: "Lemtrada"